Clinical trial inclusion criterion:
Patients who have submitted a written consent to participate in the clinical trial

Annotated entities:
- Informed_consent: "Patients who have submitted a written consent to participate in the clinical trial"